細胞膜靜止膜電位（resting membrane potential）最主要是由下列何者所決定？
A. 細胞膜上之蛋白質受器（membrane receptors）多寡
B. 細胞膜兩側通透離子（permeable ions）之濃度
C. 細胞膜兩側水分子分佈關係
D. 細胞膜兩側無法通透離子（impermeable ions）之濃度

正確答案：B. 細胞膜兩側通透離子（permeable ions）之濃度